Clinical trial inclusion criterion:
Patients undergoing surgeries in the upper limb (arm, forearm or hand)

Annotated entities:
- Procedure: "surgeries"
- Qualifier: "upper limb"
- Qualifier: "arm"
- Qualifier: "forearm"
- Qualifier: "hand"